Clinical trial exclusion criterion:
Currently taking active weight suppression medication (e.g. phentermine,orlistat, lorcaserin, naltrexone-bupropion in combination, liraglutide, benzephetamine, diethylpropion, phendimetrazine)

Entity relations:
- Subsumes("active weight suppression medication", "phentermine")
- OR("phentermine", "lorcaserin", "naltrexone-bupropion in combination", "liraglutide", "benzephetamine", "diethylpropion", "phendimetrazine", "orlistat")